dental extraction performed at least 3 month prior

The above is a clinical trial inclusion criterion. Annotated with entity spans:
[Procedure: dental extraction] performed [Temporal: at least 3 month prior]